下列關於十二指腸（duodenum）發育之敘述，何者正確？
A. 全部由前腸（foregut）衍生而來
B. 十二指腸環（duodenal loop）連接卵黃柄（yolk stalk）
C. 隨	胃的旋轉，十二指腸環（duodenal loop）會旋轉至左側
D. 因上皮細胞增生而一度閉鎖（obliteration）

正確答案：D. 因上皮細胞增生而一度閉鎖（obliteration）